Clinical trial inclusion criterion:
Men or non-pregnant women of any ethnic background between the age of 18 and 45 years old

Annotated entities:
- Person: "Men"
- Person: "women"
- Qualifier: "non-pregnant"
- Person: "age"
- Value: "18 and 45 years old"